Clinical trial exclusion criterion:
Severe right heart failure

Entity relations:
- Has_qualifier("right heart failure", "Severe")